Other causes of heart failure other than diastolic dysfunction, such as restrictive cardiomyopathy or infiltrative cardiomyopathy

The above is a clinical trial exclusion criterion. Annotated with entity spans:
Other causes of [Condition: heart failure] [Negation: other than] [Condition: diastolic dysfunction], such as [Condition: restrictive cardiomyopathy] or [Condition: infiltrative cardiomyopathy]